El mecanismo más frecuente que induce la activación del protooncogen ABL en la leucemia mieloide crónica es la:
1. Mutación puntual.
2. Ampliación génica.
3. Metilación del promotor.
4. Deleción.
5. Translocación.

Respuesta correcta: 5. Translocación.